¿Qué es un profármaco?
1. Un fármaco cabeza de serie de una clase terapéutica.
2. Un fármaco que ha sido retirado del mercado.
3. Un producto inactivo que se convierte enzimáticamente en un fármaco activo.
4. Un compuesto de origen natural del que se obtienen uno o más fármacos por hemisíntesis.
5. Un fármaco que carece de actividad pero potencia la acción de otros.

Respuesta correcta: 3. Un producto inactivo que se convierte enzimáticamente en un fármaco activo.